乳癌最重要的預後因子是：
A. 雌激素受體（estrogen receptor）
B. P53 突變
C. 腫瘤的組織分級
D. 腋窩淋巴腺的轉移

正確答案：D. 腋窩淋巴腺的轉移